ASA 1-2

The above is a clinical trial inclusion criterion. Annotated with entity spans:
[Measurement: ASA] [Value: 1-2]